Clinical trial inclusion criterion:
Age greater than or equal to 18 years and less than 80 years

Entity relations:
- Has_value("Age", "greater than or equal to 18 years and less than 80 years")